Clinical trial inclusion criterion:
Patients must have histologic proof of a malignancy suitable for radiation therapy.

Entity relations:
- AND("suitable for radiation therapy", "radiation therapy")
- Has_value("histologic", "proof")
- AND("malignancy", "histologic")
- Has_qualifier("malignancy", "suitable for radiation therapy")